Clinical trial exclusion criterion:
Post infection of knee

Annotated entities:
- Condition: "infection of knee"
- Temporal: "Post"